Clinical trial exclusion criterion:
Has a terminal illness with life expectancy < 12 months

Entity relations:
- Has_value("life expectancy", "< 12 months")